Clinical trial exclusion criterion:
Thrombin or Xa factor inhibitor;

Entity relations:
- OR("Thrombin", "Xa factor inhibitor")